Señale cuál de las siguientes técnicas está más indicada en el tratamiento de la tricotilomanía:
1. La práctica masiva.
2. La exposición con prevención de respuesta.
3. La reversión del hábito.
4. La intención paradójica.

Respuesta correcta: 3. La reversión del hábito.